Known or suspected disorders of immunoglobulin synthesis.

The above is a clinical trial exclusion criterion. Annotated with entity spans:
[Qualifier: Known] or [Qualifier: suspected] [Condition: disorders of immunoglobulin synthesis].